En una intoxicación con mercurio orgánico, ¿cuál de los siguientes órganos se verá más afectado?:
1. Tiroides.
2. Páncreas.
3. Riñón.
4. Cerebro.

Respuesta correcta: 4. Cerebro.